Clinical trial inclusion criterion:
Healthy males between 18 and 45 years of age (inclusive).

Annotated entities:
- Condition: "Healthy"
- Value: "between 18 and 45 years"
- Person: "age"